下列何者為單層膜的胞器？
A. 核仁（nucleolus）
B. 粒線體（mitochondria）
C. 核膜（nuclear envelope）
D. 溶體（lysosome）

正確答案：D. 溶體（lysosome）